下列何者會引起血中低密度脂蛋白過高？
A. 脂肪萎縮症（lipodystrophy）
B. 動情素（estrogen）
C. 甲狀腺功能不足
D. 急性肝炎

正確答案：C. 甲狀腺功能不足